Known or suspected hypersensitivity to trial products or related products

The above is a clinical trial exclusion criterion. Annotated with entity spans:
[Mood: Known] or [Mood: suspected] [Condition: hypersensitivity] to [Drug: trial products] or [Drug: related products]